Where in the body, is ghrelin secreted?

ghrelin, an orexigenic peptide, is secreted from endocrine cells in the gastric mucosa.